下列有關男性生殖的敘述，何者錯誤？
A. testosterone由Leydig cell所分泌
B. follicle-stimulating hormone由anterior pituitary所分泌
C. follicle-stimulating hormone可促進精細胞成熟（spermatid maturation）
D. gonadotropin-releasing hormone由anterior pituitary所分泌

正確答案：D. gonadotropin-releasing hormone由anterior pituitary所分泌